Supracondylar fracture

The above is a clinical trial inclusion criterion. Annotated with entity spans:
[Condition: Supracondylar fracture]